Clinical trial exclusion criterion:
Patients with a primary diagnosis of severe acute pancreatitis, without reference to a Ranson score [Ranson 1974]). However, patients with mild or moderate pancreatitis are not excluded;

Annotated entities:
- Condition: "acute pancreatitis"
- Qualifier: "severe"
- Negation: "without"
- Measurement: "Ranson score"
- Negation: "not"
- Condition: "pancreatitis"
- Qualifier: "mild"
- Qualifier: "moderate"